Clinical trial inclusion criterion:
Symptoms of ischaemia.

Entity relations:
- Has_mood("ischaemia", "Symptoms")